Clinical trial inclusion criterion:
4. Disease severity level: Gross Motor Function Classification System (GMFCS) levels I, II and III.

Annotated entities:
- Parsing_Error: "4."
- Measurement: "Gross Motor Function Classification System (GMFCS)"
- Value: "levels I, II and III"